Clinical trial exclusion criterion:
Documented LA thrombus on imaging

Entity relations:
- AND("imaging", "LA thrombus")